Clinical trial exclusion criterion:
Known allergy or hypersensitivity reaction to dexmedetomidine

Entity relations:
- AND("allergy", "dexmedetomidine")
- OR("allergy", "hypersensitivity")